Clinical trial inclusion criterion:
Healthy males between 18 and 45 years of age (inclusive).

Entity relations:
- Has_value("age", "between 18 and 45 years")